Clinical trial exclusion criterion:
Alternative treatment for low back pain in previous two weeks

Annotated entities:
- Qualifier: "Alternative"
- Procedure: "treatment"
- Condition: "low back pain"
- Temporal: "in previous two weeks"